¿Cuál de los siguientes NO se considera un criterio clasificatorio del lupus eritematoso sistémico?
1. Vasculitis cutánea.
2. Fotosensibilidad.
3. Anemia hemolítica.
4. Pericarditis.
5. Concentración elevada      de   anticuerpos antinucleares.

Respuesta correcta: 1. Vasculitis cutánea.